下列有關平滑肌的敘述，何者錯誤？
A. 在某些種類平滑肌內，鈣離子的釋放不需要動作電位（action potential）來驅動
B. 在平滑肌內，細胞質內的鈣離子濃度會受到細胞膜電位去極化的梯度變化所影響
C. 平滑肌細胞並沒有特異性的運動終板區（motor end-plate region）
D. 平滑肌的興奮或抑制完全是取決於 chemical messenger 的作用

正確答案：D. 平滑肌的興奮或抑制完全是取決於 chemical messenger 的作用